¿Cuál de las siguientes modificaciones estructurales hace que un derivado de morfina se comporte como antagonista de receptores opiodes (o de opiáceos)?:
1. Un grupo fenetilo en el nitrógeno y metilación del hidroxilo en C-3.
2. Oxidación del hidróxilo en C-6 a cetona.
3. Un grupo alilo en el nitrógeno y un hidroxilo en C-14.
4. Supresión del doble enlace C7=C8.

Respuesta correcta: 3. Un grupo alilo en el nitrógeno y un hidroxilo en C-14.